下列有關快速動眼期睡眠行為疾患（REM sleep behavior disorder）的特色，何者正確？
A. 通常在後半夜出現
B. 每次發生通常有固定的動作模式
C. 日後極可能變成阿茲海默氏症
D. 多數夢境是愉快的

正確答案：A. 通常在後半夜出現